History of clinically-significant drug allergy to nucleoside/nucleotide analogs.

The above is a clinical trial exclusion criterion. Annotated with entity spans:
History of [Qualifier: clinically-significant] [Condition: drug allergy] to [Drug: nucleoside]/[Drug: nucleotide analogs].